Evidence of Mycoplasma pneumoniae infection

The above is a clinical trial inclusion criterion. Annotated with entity spans:
Evidence of [Condition: Mycoplasma pneumoniae infection]